El wolframio es un elemento muy importante desde el punto de vista tecnológico, que se utiliza, entre otras cosas, en la industria de los aceros. Pero su interés se extiende a otros campos científicos, debido a:
1. Que es uno de los elementos esenciales para la vida se seres humanos y animales.
2. Que es líquido en el intervalo 27ºC-2500ºC, lo que explica su uso en termómetros de alta temperatura.
3. Su incapacidad para reaccionar con el oxígeno incluso a temperaturas tan elevadas como calentar al rojo.
4. Su total resistencia al flúor incluso a temperaturas tan elevadas como calentar al rojo.
5. Su gran resistencia mecánica.

Respuesta correcta: 5. Su gran resistencia mecánica.